一個 3 天大新生兒，雙眼有化膿性分泌物，格蘭氏染色（Gram stain）為格蘭氏陰性雙球菌，應選用何種抗生素治療？
A. ceftriaxone
B. erythromycin
C. oxacillin
D. tetracycline

正確答案：A. ceftriaxone